Clinical trial inclusion criterion:
Scheduled for closed reduction with percutaneous pinning under general anesthesia

Annotated entities:
- Procedure: "closed reduction with percutaneous pinning"
- Procedure: "general anesthesia"
- Mood: "Scheduled for"